Frequent HAs that started within 3months after a head injury. The HAs either 1) must last 4 or more hours a day and reach a moderate to severe intensity at any point during the headache, or 2) may be of any severity or duration if the participant takes a triptan or ergotamine. HAs meeting these criteria must have been present on average at least 8 days per 4-week period, starting within 30 days after head injury and occurring by self-report for at least 3 months prior to the Initial Screening Visit. The 4-week HA frequency/severity criteria must be confirmed during the Preliminary Screening Period.

The above is a clinical trial inclusion criterion. Annotated with entity spans:
[Qualifier: Frequent] [Condition: HAs] that started [Temporal: within 3months after a head injury]. The [Condition: HAs] either 1) must [Multiplier: last 4 or more hours a day] and reach a [Qualifier: moderate to severe intensity] at any point during the headache, or 2) may be of any severity or duration if the participant takes a [Drug: triptan] or [Drug: ergotamine]. HAs meeting these criteria must have been present on average [Multiplier: at least 8 days per 4-week period], starting [Temporal: within 30 days after head injury] and occurring by self-report for [Temporal: at least 3 months prior to the Initial Screening Visit]. The 4-week HA frequency/severity criteria must be confirmed during the Preliminary Screening Period.